Clinical trial inclusion criterion:
obstructive sleep apnea or recurrent throat infections

Annotated entities:
- Condition: "obstructive sleep apnea"
- Multiplier: "recurrent"
- Condition: "throat infections"